有關腎上腺素（epinephrine）和正腎上腺素（norepinephrine）之升血壓作用，下列何者敘述錯誤？
A. 腎上腺素的升血壓作用主要在增加心臟的收縮力和心跳速率
B. 給予正腎上腺素會造成反射性的心跳降低
C. 腎上腺素的升血壓作用主要經由α1腎上腺素受器（α1-adrenergic receptors）
D. 正腎上腺素的升血壓作用主要是經由增加周邊血管阻力

正確答案：C. 腎上腺素的升血壓作用主要經由α1腎上腺素受器（α1-adrenergic receptors）